Clinical trial inclusion criterion:
Hemoglobin >= 9 g/dL

Entity relations:
- Has_value("Hemoglobin", ">= 9 g/dL")